Clinical trial exclusion criteria:
Healthy Volunteers
Treprostinil contraindications: Known hypersensitivity to treprostinil or any of the excipients, Pulmonary arterial hypertension related to veno-occlusive disease, Congestive heart failure due to severe left ventricular dysfunction, Severe hepatic insufficiency (Child-Pugh stage C), Evolving gastrointestinal ulcer, intracranial hemorrhage, recent trauma or other clinical condition that may lead to bleeding, Congenital or acquired valvular abnormalities with cardiac repercussions, Severe ischemic heart disease or unstable angina; Myocardial infarction in the last six months; Decompensated cardiac insufficiency not medically controlled; Severe arrhythmias; Cerebrovascular lesions (such as transient ischemic attack, stroke) that occurred within the last three months.
Persons referred to in Articles L1121-5 to L1121-8 of the French Public health Code: pregnant woman, parturient, nursing mother, person deprived of liberty by judicial or administrative decision, person subject to a legal protection measure, can not Be included in clinical trials.
Subject in an exclusion period from another study,
Subject who would receive more than 4500 euros of compensation due to his participation in other biomedical research in the 12 months preceding this study
Systemic sclerosis patients:
Iloprost cure carried out in the previous month or planned in the following month.
Initiation or change of dosage of bosentan, sildenafil or calcium channel blockers in the previous month or in the following month
Digital Sympathectomy or botulinum toxin injection planned in the following month.
Clinically superinfected digital ulcers
Treprostinil contraindications: Known hypersensitivity to treprostinil or any of the excipients, Pulmonary arterial hypertension related to veno-occlusive disease, Congestive heart failure due to severe left ventricular dysfunction, Severe hepatic insufficiency (Child-Pugh stage C), Evolving gastrointestinal ulcer, intracranial hemorrhage, recent trauma or other clinical condition that may lead to bleeding, Congenital or acquired valvular abnormalities with cardiac repercussions, Severe ischemic heart disease or unstable angina; Myocardial infarction in the last six months; Decompensated cardiac insufficiency not medically controlled; Severe arrhythmias; Cerebrovascular lesions (such as transient ischemic attack, stroke) that occurred within the last three months.
Persons referred to in Articles L1121-5 to L1121-8 of the French Public health Code: pregnant woman, parturient, nursing mother, person deprived of liberty by judicial or administrative decision, person subject to a legal protection measure, can not Be included in clinical trials.
Subject in an exclusion period from another study,
Subject who would receive more than 4500 euros of compensation due to his participation in other biomedical research in the 12 months preceding this study

Annotated entities:
- Parsing_Error: "Healthy Volunteers"
- Condition: "contraindications"
- Drug: "Treprostinil"
- Condition: "hypersensitivity"
- Drug: "treprostinil"
- Drug: "any of the excipients"
- Condition: "Pulmonary arterial hypertension"
- Condition: "veno-occlusive disease"
- Condition: "Congestive heart failure"
- Condition: "left ventricular dysfunction"
- Condition: "hepatic insufficiency"
- Qualifier: "severe"
- Qualifier: "Severe"
- Measurement: "Child-Pugh"
- Value: "stage C"
- Condition: "gastrointestinal ulcer"
- Qualifier: "Evolving"
- Condition: "intracranial hemorrhage"
- Condition: "trauma"
- Temporal: "recent"
- Condition: "clinical condition that may lead to bleeding"
- Undefined_semantics: "clinical condition that may lead to bleeding"
- Condition: "Congenital valvular abnormalities"
- Condition: "acquired valvular abnormalities"
- Qualifier: "with cardiac repercussions"
- Condition: "ischemic heart disease"
- Qualifier: "Severe"
- Condition: "unstable angina"
- Condition: "Myocardial infarction"
- Temporal: "in the last six months"
- Condition: "Decompensated cardiac insufficiency"
- Qualifier: "not medically controlled"
- Condition: "arrhythmias"
- Qualifier: "Severe"
- Condition: "Cerebrovascular lesions"
- Condition: "transient ischemic attack"
- Condition: "stroke"
- Temporal: "within the last three months"
- Context_Error: "Persons referred to in Articles L1121-5 to L1121-8 of the French Public health Code"
- Condition: "pregnant"
- Person: "woman"
- Condition: "parturient"
- Condition: "nursing"
- Observation: "deprived of liberty"
- Context_Error: "Subject in an exclusion period from another study,"
- Non-query-able: "Subject in an exclusion period from another study,"
- Non-query-able: "Subject who would receive more than 4500 euros of compensation due to his participation in other biomedical research in the 12 months preceding this study"
- Context_Error: "Subject who would receive more than 4500 euros of compensation due to his participation in other biomedical research in the 12 months preceding this study"
- Condition: "Systemic sclerosis"
- Drug: "Iloprost"
- Temporal: "in the previous month"
- Temporal: "in the following month"
- Mood: "planned"
- Drug: "Iloprost"
- Non-query-able: "planned in the following month"
- Drug: "bosentan"
- Drug: "sildenafil"
- Drug: "calcium channel blockers"
- Temporal: "in the previous month"
- Temporal: "in the following month"
- Procedure: "Digital Sympathectomy"
- Procedure: "botulinum toxin injection"
- Mood: "planned"
- Non-query-able: "planned"
- Temporal: "in the following month"
- Condition: "digital ulcers"
- Observation: "superinfected"
- Drug: "Treprostinil"
- Condition: "contraindications"
- Condition: "hypersensitivity"
- Drug: "treprostinil"
- Drug: "any of the excipients"
- Condition: "Pulmonary arterial hypertension"
- Condition: "veno-occlusive disease"
- Condition: "Congestive heart failure"
- Condition: "left ventricular dysfunction"
- Qualifier: "severe"
- Condition: "hepatic insufficiency"
- Qualifier: "Severe"
- Measurement: "Child-Pugh"
- Value: "stage C"
- Condition: "gastrointestinal ulcer"
- Condition: "intracranial hemorrhage"
- Condition: "trauma"
- Temporal: "recent"
- Condition: "clinical condition that may lead to bleeding"
- Undefined_semantics: "clinical condition that may lead to bleeding"
- Condition: "Congenital valvular abnormalities"
- Condition: "acquired valvular abnormalities"
- Qualifier: "with cardiac repercussions"
- Condition: "ischemic heart disease"
- Qualifier: "Severe"
- Condition: "unstable angina"
- Condition: "Myocardial infarction"
- Temporal: "in the last six months"
- Condition: "Decompensated cardiac insufficiency"
- Condition: "arrhythmias"
- Qualifier: "Severe"
- Condition: "Cerebrovascular lesions"
- Condition: "transient ischemic attack"
- Condition: "stroke"
- Temporal: "within the last three months"
- Context_Error: "Persons referred to in Articles L1121-5 to L1121-8 of the French Public health Code"
- Condition: "pregnant"
- Person: "woman"
- Condition: "parturient"
- Condition: "nursing"
- Observation: "deprived of liberty"
- Observation: "subject to a legal protection"
- Non-query-able: "Subject in an exclusion period from another study"
- Context_Error: "Subject in an exclusion period from another study"
- Non-query-able: "Subject who would receive more than 4500 euros of compensation due to his participation in other biomedical research in the 12 months preceding this study"